During this pilot study, we will exclude non-English speaking families. However, in subsequent studies we will include the non-English speaking population.

The above is a clinical trial exclusion criterion. Annotated with entity spans:
During this pilot study, we will exclude [Observation: non-English speaking] families. [Non-representable: However, in subsequent studies we will include the non-English speaking population.]